Clinical trial exclusion criterion:
History of anticholinergic drug allergy or complications (allergic reaction, skin rash, urticaria and other allergic reactions which caused by drugs).

Entity relations:
- Has_qualifier("allergic reactions", "other")
- AND("allergic reaction", "drugs")
- AND("allergy", "anticholinergic drug")
- Subsumes("allergy", "allergic reaction")
- OR("allergic reaction", "skin rash", "urticaria", "allergic reactions")